下列何種神經病變，病人的上肢會呈現如「侍者小費（waiter tip）」的表現？
A. 臂神經叢
B. 正中神經
C. 尺神經
D. 橈神經

正確答案：A. 臂神經叢